BMI 20 - 35 kg/m2

The above is a clinical trial inclusion criterion. Annotated with entity spans:
[Measurement: BMI] [Value: 20 - 35 kg/m2]